Fluency in English spoken language

The above is a clinical trial inclusion criterion. Annotated with entity spans:
[Non-query-able: Fluency in English spoken language]